Clinical trial exclusion criterion:
Subject with a history of congenital QT prolongation

Annotated entities:
- Condition: "congenital QT prolongation"
- Temporal: "history of"